下列何構造不位於小腦橋腦角（cerebellopontine angle）？
A. 顏面神經（facial nerve）
B. 外旋神經（abducens nerve）
C. 前庭耳蝸神經（vestibulocochlear nerve）
D. 中間神經（nervus intermedius）

正確答案：B. 外旋神經（abducens nerve）